Clinical trial exclusion criterion:
Participation in another clinical ulcer-healing study within the last 4 weeks

Annotated entities:
- Non-query-able: "Participation in another clinical ulcer-healing study within the last 4 weeks"